Immunosuppressive disorders or medications (including oral prednisone >10 mg daily, recent chemotherapy treatment)

The above is a clinical trial exclusion criterion. Annotated with entity spans:
[Condition: Immunosuppressive disorders] or medications (including [Drug: oral prednisone] [Multiplier: >10 mg daily], recent [Procedure: chemotherapy] treatment)